成熟奶可分為前奶及後奶，後奶含何種營養成分較多？
A. 蛋白質
B. 脂肪
C. 醣類
D. 維他命

正確答案：B. 脂肪